Clinical trial exclusion criterion:
Patients who are known to be pregnant or lactating;

Annotated entities:
- Pregnancy_considerations: "Patients who are known to be pregnant or lactating"